Clinical trial exclusion criterion:
2. Researchers think that Patients with disease may be interference results(e.g., Spinal deformity, spine fracture, ankylosing spondylitis, spinal tuberculosis and spinal infection, spinal tumor, pelvic inflammatory disease and other disease of department of gynaecology, etc)

Entity relations:
- OR("Spinal deformity", "spine fracture,", "ankylosing spondylitis", "spinal tuberculosis", "spinal infection", "spinal tumor", "pelvic inflammatory disease")